Patients with severe complications or severe infection;

The above is a clinical trial exclusion criterion. Annotated with entity spans:
[Drug: Patients] with [Qualifier: severe] [Condition: complications] or [Qualifier: severe] [Condition: infection];